Clinical trial exclusion criterion:
Subject has 2° type II, 3° degree AV-block or left/right bundle branch block pattern.

Annotated entities:
- Condition: "3° degree AV-block"
- Condition: "2° type II AV-block"
- Condition: "right bundle branch block"
- Condition: "left bundle branch block"